Clinical trial inclusion criterion:
Undergoing abdominoplasty or TRAM flap breast reconstruction

Entity relations:
- OR("abdominoplasty", "TRAM flap breast reconstruction")